persistent HbA1c levels = 7.5% (58 mmol/mol) despite optimized education therapy,

The above is a clinical trial inclusion criterion. Annotated with entity spans:
[Multiplier: persistent] [Measurement: HbA1c levels] [Value: = 7.5%] ([Value: 58 mmol/mol]) despite [Procedure: optimized education therapy],